Clinical trial exclusion criterion:
Drug allergy

Annotated entities:
- Condition: "allergy"
- Drug: "Drug"